王女士，48歲，過去除自然生產兩次外無特殊疾病史，因陰道大量出血至急診求診，經內診發現子宮頸有一7 公分腫瘤，切片證實為子宮頸鱗狀上皮癌，腫瘤範圍至下1/3陰道後壁，子宮旁組織柔軟無侵犯跡象，胸部X 光正常，腎盂攝影並無顯示腎盂或輸尿管水腫，電腦斷層未見淋巴結腫大，依據目前國際婦產科聯盟 （International Federation of Gynecology and Obstetrics, FIGO）分期，王女士子宮頸癌臨床期別為何？
A. Ib3
B. IIa2
C. IIb
D. IIIa

正確答案：D. IIIa